Osteoporosis

The above is a clinical trial exclusion criterion. Annotated with entity spans:
[Condition: Osteoporosis]